Clinical trial exclusion criterion:
QTcF > 500 msec

Annotated entities:
- Measurement: "QTcF"
- Value: "> 500 msec"